Clinical trial inclusion criteria:
Healthy men and women, age 40-75 yrs, without any disease and need of medication.
Born, raised and currently living at low altitude (<800m).
Written informed consent.
Kyrgyz ethnicity

Annotated entities:
- Observation: "Healthy"
- Person: "men"
- Person: "women"
- Person: "age"
- Value: "40-75 yrs"
- Negation: "without"
- Condition: "any disease"
- Mood: "need of"
- Drug: "medication"
- Observation: "living at low altitude"
- Observation: "living at <800m"
- Informed_consent: "Written informed consent."
- Person: "Kyrgyz ethnicity"